Clinical trial exclusion criteria:
Intolerance or allergy to ASA, clopidogrel or ticlopidine precluding treatment for 12 months
Concurrent participation in other investigational study
Femoral sheath (artery)

Annotated entities:
- Condition: "Intolerance"
- Condition: "allergy"
- Drug: "ASA"
- Drug: "clopidogrel"
- Drug: "ticlopidine"
- Temporal: "for 12 months"
- Negation: "precluding"
- Procedure: "treatment"
- Competing_trial: "Concurrent participation in other investigational study"
- Condition: "Femoral sheath (artery)"